下列何種激素最不會影響生長發育？
A. 甲狀腺素
B. 雄性素
C. 降鈣素
D. 生長激素

正確答案：C. 降鈣素